Blood platelet count<100,000/L

The above is a clinical trial exclusion criterion. Annotated with entity spans:
[Measurement: Blood platelet count][Value: <100,000/L]